Anemia (hematocrit < 27%)

The above is a clinical trial exclusion criterion. Annotated with entity spans:
[Condition: Anemia] ([Measurement: hematocrit] [Value: < 27%])